Clinical trial inclusion criterion:
Life expectancy of > 3 months

Annotated entities:
- Observation: "Life expectancy"
- Value: "> 3 months"